• Psoriasis (physician-diagnosed)

The above is a clinical trial inclusion criterion. Annotated with entity spans:
• [Condition: Psoriasis] (physician-diagnosed)